一位67歲女性，服用含類固醇中藥多年治療背痛，有庫欣氏症（Cushing's syndrome）外觀，經家人勸告後已停藥1個月。現因泌尿道感染引發低血壓休克、意識不清被送來急診。除使用抗生素、輸液、升壓藥物治療外，應立刻給與何種處置？
A. 立即抽血送	cortisol，不必等報告結果出來，可立即注射糖皮質素（glucocorticoid）治療
B. 立即抽血送	cortisol，須等報告結果出來確認為腎上腺機能不足，才能給與糖皮質素（glucocorticoid）治療
C. 抽血送	上午8點與下午4點的cortisol後，立即注射糖皮質素（glucocorticoid）治療
D. 立刻進行促腎上腺素刺激測	（ACTH stimulation test），測	完畢立即注射糖皮質素（glucocorticoid）治療

正確答案：A. 立即抽血送	cortisol，不必等報告結果出來，可立即注射糖皮質素（glucocorticoid）治療